Clinical trial exclusion criterion:
Endometriosis

Annotated entities:
- Condition: "Endometriosis"